Pseudomonas aeruginosa es típicamente:
1. Sensible a la mayoría de antibióticos utilizados en medicina humana.
2. Patógeno obligado.
3. Patógeno oportunista.
4. Bacteria comensal del tracto digestivo.
5. Patógeno intracelular.

Respuesta correcta: 3. Patógeno oportunista.